Diagnosis of any other neurologic disease

The above is a clinical trial exclusion criterion. Annotated with entity spans:
Diagnosis of [Qualifier: any other] [Condition: neurologic disease]